Clinical trial exclusion criterion:
History of obstructive urinary disorders and dysuria, prostatic hypertrophy, prostatitis, and other lower urinary tract obstructive disorders.

Entity relations:
- Has_qualifier("lower urinary tract obstructive disorders", "other")
- Has_temporal("obstructive urinary disorders", "History")
- OR("obstructive urinary disorders", "lower urinary tract obstructive disorders", "prostatic hypertrophy", "dysuria", "prostatitis")